Clinical trial exclusion criterion:
Patients unable to consent

Annotated entities:
- Non-query-able: "Patients unable to consent"